Clinical trial exclusion criterion:
Emergency surgeries

Annotated entities:
- Procedure: "Emergency surgeries"